What is the SPRTN protein function?

The protease SPRTN emerged as the essential enzyme for DNA-protein crosslink proteolysis repair.